Severe cognitive impairment (defined as score = 5 on the Short Portable Mental Status Questionnaire)

The above is a clinical trial exclusion criterion. Annotated with entity spans:
[Qualifier: Severe] [Condition: cognitive impairment] (defined as score [Value: = 5] on the [Measurement: Short Portable Mental Status Questionnaire])